Clinical trial inclusion criterion:
Persistent primary or recurrent trans-sphincteric anal fistula

Entity relations:
- Has_multiplier("trans-sphincteric anal fistula", "primary")
- OR("primary", "recurrent")